Clinical trial inclusion criterion:
BMI < 28

Annotated entities:
- Measurement: "BMI"
- Value: "< 28"